Clinical trial exclusion criterion:
20. History of allogeneic organ transplant

Entity relations:
- Has_temporal("allogeneic organ transplant", "History")